Body Mass Index of 30-40 kg/m2, inclusive. Heterozygous subjects may have a broader BMI range; to be eligible heterozygous subjects may have a BMI 27 -55 kg/ m2, inclusive.

The above is a clinical trial inclusion criterion. Annotated with entity spans:
[Measurement: Body Mass Index] of [Value: 30-40 kg/m2, inclusive]. [Parsing_Error: Heterozygous subjects may have a broader BMI range; to be eligible heterozygous subjects may have a BMI 27 -55 kg/ m2, inclusive.]